Clinical trial exclusion criterion:
Person who walks on average less than 1km per day.

Entity relations:
- Has_multiplier("walks", "ess than 1km per day")